酒精戒斷癲癎（alcohol withdrawal seizure）之敘述，下列何者為最適當?
A. 常發生在停止喝酒五至六天後
B. 發生single seizure比multiple generalized seizure比例高
C. 大多發生在停止喝酒2天內
D. 超過70%以上產生酒精戒斷癲癎病人會合併有delirium tremens

正確答案：C. 大多發生在停止喝酒2天內